Clinical trial inclusion criterion:
Women must be postmenopausal (i.e.12 months without menstrual period), or surgically sterile, i.e. women of child bearing potential are not allowed to be included into the study. In cases of doubt a pregnancy test should be performed. (NB -post menopausal women currently receiving hormone replacement are permissible)

Annotated entities:
- Condition: "postmenopausal"
- Person: "Women"
- Temporal: "12 months"
- Condition: "menstrual period"
- Negation: "without"
- Condition: "surgically sterile"
- Person: "women"
- Condition: "child bearing potential"
- Negation: "not"
- Condition: "pregnancy test"
- Qualifier: "doubt"